Contraindication to neuraxial (coagulopathy, anticoagulant use, local infection, sepsis etc) .Rupture of membranes.

The above is a clinical trial exclusion criterion. Annotated with entity spans:
[Condition: Contraindication] to [Procedure: neuraxial] ([Condition: coagulopathy], [Drug: anticoagulant] use, [Condition: local infection], [Condition: sepsis] etc) .[Condition: Rupture of membranes].